有關排卵藥clomiphene citrate敘述，下列何者錯誤？
A. 主要可以治療促性腺激素低下型低性腺功能症（hypogonadotropic hypogonadism WHO group I）患者的無排卵現象
B. 選擇性雌激素接受器調節劑，可以影響雌激素負回饋反應，刺激濾泡發育
C. 治療的副作用可能包括子宮頸黏液分泌減少、子宮內膜生長受損以及多胞胎妊娠
D. 某些病患治療後仍然無法排卵時，可以結合胰島素增敏劑metformin，增加排卵的機會

正確答案：A. 主要可以治療促性腺激素低下型低性腺功能症（hypogonadotropic hypogonadism WHO group I）患者的無排卵現象